Clinical trial inclusion criterion:
Participant aged 19 or over

Entity relations:
- Has_value("aged", "19 or over")